Clinical trial exclusion criterion:
on medication e.g. steroid, multivitamins, thiamine-containing vitamins, diuretic drugs

Entity relations:
- OR("steroid", "diuretic drugs", "multivitamins", "thiamine-containing vitamins")